Where in the body, is ghrelin secreted?

Ghrelin , an orexigenic peptide , is secreted from endocrine cells in the gastric mucosa .